Clinical trial exclusion criterion:
Need for anterior surgery or for vertebral column resection.

Entity relations:
- Has_mood("anterior surgery", "Need for")
- OR("anterior surgery", "vertebral column resection")